下列有關慢性肛裂的敘述，何者為真？
A. 只有男性病人才以 6 點鐘方向（正後方）者為最多見
B. 女性病人以發生在 12 點鐘方向（正前方）者為最多見
C. 不論男女，皆以發生在 6 點鐘方向者為最多見
D. 發生在 6 點鐘或 12 點鐘方向之機會一樣

正確答案：C. 不論男女，皆以發生在 6 點鐘方向者為最多見